Which is the primary interacting protein of BLK?

bank1